¿Cuál de los siguientes factores no influye en la permeación de los fármacos a través de la capa córnea?:
1. Grado de ionización del fármaco.
2. Fijación a las proteínas del fluido lagrimal.
3. Osmolaridad de las lágrimas.
4. Volumen instilado.
5. Pigmentación Ocular.

Respuesta correcta: 3. Osmolaridad de las lágrimas.